¿Cuál es la respuesta INCORRECTA?:
1. Durkheim estaba en contra de utilizar el método científico en el estudio de los fenómenos sociales.
2. Comte acuñó el término de Sociología.
3. Para Weber las Ciencias Sociales deben explicar los significados de la acción social.
4. Marx analizó la influencia del capitalismo y el conflicto de clases.

Respuesta correcta: 1. Durkheim estaba en contra de utilizar el método científico en el estudio de los fenómenos sociales.